傳導疼痛的體表神經接受器（somatosensory receptor）是：
A. free nerve endings
B. Pacinian corpuscles
C. Merkel's disks
D. Ruffini's endings

正確答案：A. free nerve endings